Clinical trial exclusion criterion:
Candidate for topical anti-inflammatory

Entity relations:
- Has_mood("topical anti-inflammatory", "Candidate for")